Clinical trial exclusion criterion:
Pregnant or lactating.

Annotated entities:
- Condition: "Pregnant"
- Condition: "lactating"